下列有關肝臟超音波檢查的描述，何者錯誤？
A. 肝圓韌帶（ligamentum teres）為高回音性
B. 正常肝內肝動脈與膽管較門靜脈難偵測
C. 肝之脂肪性變化為高回音性
D. 肝血管瘤為低回音性，不會呈現高回音

正確答案：D. 肝血管瘤為低回音性，不會呈現高回音